Clinical trial exclusion criterion:
Paracetamol ingestion in the previous 48 hours

Entity relations:
- Has_temporal("Paracetamol", "in the previous 48 hours")